Clinical trial inclusion criterion:
6. Total occluded vessels. One total occluded major epicardial vessel or side branch can be included and targeted as long as one other major vessel has a significant stenosis amenable for SA, provided the age of occlusion is less than one month e.g. recent instability, infarction with ECG changes in the area subtended by the occluded vessel. Patients with total occluded vessels of unknown duration or existing longer than one month and a reference over 1.50 mm should not be included, not even as a third or fourth vessel to be dilated;

Entity relations:
- Has_temporal("total occluded vessels", "unknown duration")
- Has_multiplier("total occluded major epicardial vessel", "One")
- Subsumes("Total occluded vessels", "total occluded major epicardial vessel")
- OR("unknown duration", "longer than one month")
- OR("total occluded major epicardial vessel", "total occluded side branch")